下列何種離子大量進入消化道平滑肌細胞，會引發 spike potential 後引起平滑肌收縮？
A. 鈉離子
B. 鉀離子
C. 鈣離子
D. 鎂離子

正確答案：C. 鈣離子